Clinical trial exclusion criterion:
Metastatic disease (M1)/stage 4 NSCLC

Entity relations:
- Subsumes("Metastatic disease NSCLC", "(M1)/stage 4")